Clinical trial inclusion criterion:
History of three or more consecutively failed In Vitro Fertilization (IVF) cycles after embryo transfer.

Entity relations:
- Subsumes("In Vitro Fertilization", "IVF")
- Has_index("after embryo transfer", "embryo transfer")
- Has_qualifier("In Vitro Fertilization", "consecutively failed")
- Has_multiplier("In Vitro Fertilization", "three or more")
- Has_temporal("In Vitro Fertilization", "after embryo transfer")